Clinical trial inclusion criterion:
Patients able to complete trial procedures

Annotated entities:
- Post-eligibility: "Patients able to complete trial procedures"